Clinical trial exclusion criterion:
cardiorespiratory arrest,

Annotated entities:
- Condition: "cardiorespiratory arrest"